一位 29 歲女性半夜至急診，主訴為 20 分鐘前開始突發性腹痛，伴隨著少量陰道出血（vaginal spotting）。病人自述平時月經不規則。理學檢查發現血壓為 95/50 mmHg，心跳為 110/min，體溫為 36.5℃，右下腹部有壓痛（tenderness）以及反彈痛（rebounding pain）。你認為以下何者為下一步最需要做的檢查？
A. C-reactive protein（CRP）
B. 尿液β- hCG 檢查
C. 電腦斷層檢查
D. 腹部 X 光（KUB）

正確答案：B. 尿液β- hCG 檢查